What disease can be treated with Avacopan?

Avacopan is effective for ANCA-associated vasculitis.